Clinical trial exclusion criterion:
Secondary hypertension or malignant hypertension

Annotated entities:
- Condition: "Secondary hypertension"
- Condition: "malignant hypertension"